(9)Participation in a clinical trial for a drug that has not yet been officially approved for marketing within one month prior to the first visit.

The above is a clinical trial exclusion criterion. Annotated with entity spans:
(9)[Observation: Participation in a clinical trial] for a [Drug: drug that has not yet been officially approved for marketing] [Temporal: within one month prior to the first visit].